Clinical trial inclusion criterion:
Physically healthy adults age 18-55 who meet DSM-5 criteria for insomnia and Criterion A (exposure to a traumatic event) for PTSD. The index trauma must have occurred within the past 5 years and at least 3 months before enrolling, and insomnia symptoms must have started or worsened after the exposure to the index trauma

Annotated entities:
- Qualifier: "healthy"
- Person: "adults"
- Person: "age"
- Value: "18-55"
- Condition: "insomnia"
- Qualifier: "DSM-5"
- Condition: "PTSD"
- Qualifier: "Criterion A"
- Condition: "trauma"
- Qualifier: "index"
- Temporal: "the past 5 years and at least 3 months"
- Non-query-able: "and insomnia symptoms must have started or worsened after the exposure to the index trauma"